Non-compliant with blood-letting

The above is a clinical trial exclusion criterion. Annotated with entity spans:
[Condition: Non-compliant] with [Procedure: blood-letting]